一位 45 歲的男性，因為搬重物引起急性下背痛，同時合併右下肢疼痛，疼痛的感覺類似於針刺，並且會傳導到小腿的後外側，沒辦法踮腳尖走路，理學檢查發現右側 SLRT（Straight Leg Raising Test）在 60 度時就會引起劇痛，左側 SLRT 則為正常，右側四頭肌肌力約 5 分、右側足部背屈約 4 分、右側足部掌屈約 3 分，左側下肢肌力則均為 5 分，右足部外側靠近第五趾與小腿後外側感覺異常，請問病灶最可能的部位在下列何者？
A. 第三、四腰椎、椎間盤突出
B. 第四、五腰椎、椎間盤突出
C. 第五腰椎與第一薦椎、椎間盤突出
D. 第一、二薦椎、椎間盤突出

正確答案：C. 第五腰椎與第一薦椎、椎間盤突出